Those who weigh more than 40kg

The above is a clinical trial inclusion criterion. Annotated with entity spans:
Those who [Measurement: weigh] [Value: more than 40kg]